Clinical trial exclusion criterion:
have received influenza vaccination within the past 6 months

Entity relations:
- Has_temporal("influenza vaccination", "within the past 6 months")